Clinical trial inclusion criterion:
known platelet count < 100.000/µL at the time of screening

Entity relations:
- Has_index("at the time of screening", "the time of screening")
- Has_value("platelet count", "< 100.000/µL")
- Has_temporal("platelet count", "at the time of screening")